Have not received influenza vaccination in the past or cannot be vaccinated due to previous severe reaction to influenza vaccine, egg, latex, or thimerosol allergies, or refusal of vaccination

The above is a clinical trial exclusion criterion. Annotated with entity spans:
Have [Negation: not] received [Procedure: influenza vaccination] in the past or cannot be vaccinated due to previous severe reaction to influenza vaccine, egg, latex, or thimerosol allergies, or refusal of vaccination